All patients must be informed of the investigational nature of this study and give written informed consent in accordance with institutional and federal guidelines.

The above is a clinical trial inclusion criterion. Annotated with entity spans:
[Post-eligibility: All patients must be informed of the investigational nature of this study and give written informed consent in accordance with institutional and federal guidelines.]